Holliday intermediate 的結構會在下列何種反應中出現？
A. 轉錄作用（transcription）
B. 轉譯作用（translation）
C. 轉位作用（transposition）
D. 同源重組（homologous genetic recombination）

正確答案：D. 同源重組（homologous genetic recombination）